Clinical trial exclusion criterion:
Chronic nasal congestion

Annotated entities:
- Condition: "nasal congestion"
- Temporal: "Chronic"